Clinical trial exclusion criterion:
Symptomatic coronary artery disease deemed to be significant by study physician at the time of screening

Entity relations:
- Has_qualifier("coronary artery disease", "Symptomatic")
- Has_index("at the time of screening", "time of screening")